Patients diagnosed at the out-patient cystoscopy with papillary bladder tumour will be legible for inclusion

The above is a clinical trial inclusion criterion. Annotated with entity spans:
Patients diagnosed at the [Visit: out-patient] [Procedure: cystoscopy] with [Condition: papillary bladder tumour] will be legible for inclusion